尿素有兩個氮原子。假如第一個氮原子是從氨來的，第二個氮原子是從下列何者來的？
A. aspartate
B. histidine
C. arginine
D. ornithine

正確答案：A. aspartate